Clinical trial exclusion criterion:
Unable to continue participation for 156 weeks

Annotated entities:
- Post-eligibility: "Unable to continue participation for 156 weeks"